Clinical trial exclusion criterion:
life expectancy of less than 18months

Entity relations:
- Has_value("life expectancy", "less than 18months")